Subjects who are geographically stable and available for follow-up at the study center for the length of the study

The above is a clinical trial inclusion criterion. Annotated with entity spans:
Subjects who are [Person: geographically stable] and [Observation: available for follow-up] [Visit: at the study center] [Temporal: for the length of the study]